Clinical trial exclusion criterion:
History of deep venous thrombosis

Annotated entities:
- Condition: "deep venous thrombosis"
- Temporal: "History"